下列何者由後腎中胚層（metanephric mesoderm）形成？
A. 輸尿管（ureter）
B. 集尿管（collecting duct）
C. 近曲小管（proximal convoluted tubule）
D. 小腎盞（minor calyx）

正確答案：C. 近曲小管（proximal convoluted tubule）